History of any use of citalopram or escitalopram during the current episode or need for drugs that may interact with these agents, i.e. drug metabolized by the 2D6 P450 isoenzyme system;

The above is a clinical trial exclusion criterion. Annotated with entity spans:
History of any use of [Drug: citalopram] or [Drug: escitalopram] during the [Qualifier: current] [Condition: episode] or [Non-query-able: need for drugs that may interact with these agents, i.e. drug metabolized by the 2D6 P450 isoenzyme system];